Clinical trial inclusion criterion:
Mild-to-moderate RDS;

Entity relations:
- Has_value("RDS", "Mild-to-moderate")